Absolute neutrophil count >= 1.5 x 109/L, Hemoglobin >= 9g/dL, Platelets>=100 x 109/L Bilirubin <= 1.5 x upper limit of normal AST/ALT <= 2.5 X upper limit of normal(5.0 x upper limit of normal, for subject with liver metastases) Creatinine<= 1.5 X UNL

The above is a clinical trial inclusion criterion. Annotated with entity spans:
[Measurement: Absolute neutrophil count] [Value: >= 1.5 x 109/L], [Measurement: Hemoglobin] [Value: >= 9g/dL,] [Measurement: Platelets][Value: >=100 x 109/L] [Measurement: Bilirubin] [Value: <= 1.5 x upper limit of normal] [Measurement: AST]/[Measurement: ALT] [Value: <= 2.5 X upper limit of normal(][Value: 5.0 x upper limit of normal], for subject with [Condition: liver metastases]) [Measurement: Creatinine][Value: <= 1.5 X UNL]